Los pacientes con disfagia deben evitar los siguientes alimentos, EXCEPTO:
1. Purés homogéneos.
2. De textura fibrosa, como espárragos, piña, jamón serrano.
3. Que contengan espinas y huesos.
4. Que se desmenucen en la boca, como arroz, patatas chips.
5. Alimentos pegajosos y densos, como el pan de molde.

Respuesta correcta: 1. Purés homogéneos.